PMH of diagnosed heart, kidney, peripheral vascular, or cerebral vascular disease, or diabetes mellitus;

The above is a clinical trial exclusion criterion. Annotated with entity spans:
PMH of diagnosed [Condition: heart], [Condition: kidney], [Condition: peripheral vascular,] or [Condition: cerebral vascular disease], or [Condition: diabetes mellitus];